Must be willing to provide and have available archival tissue for PD-L1 testing.

The above is a clinical trial inclusion criterion. Annotated with entity spans:
[Non-query-able: Must be willing to provide and have available archival tissue for PD-L1 testing.]